Clinical trial inclusion criterion:
Male and female subjects between 40-85 years old will be enrolled. Younger subjects are not included as the risk for brain amyloid lesions is too low

Annotated entities:
- Person: "Male"
- Person: "female"
- Value: "between 40-85 years"
- Person: "old"
- Non-representable: "Younger subjects are not included as the risk for brain amyloid lesions is too low"